Clinical trial exclusion criterion:
History or evidence of a stroke

Entity relations:
- Has_temporal("stroke", "History")
- OR("History", "evidence")